Clinical trial exclusion criterion:
Undergoing concomitant prolapse surgery

Annotated entities:
- Procedure: "prolapse surgery"